What monoclonal antibody drugs are used to treat late stage melanoma?

Nivolumab,  ipilimumab, vemurafenib, and dabrafenib are used to treat late stage melanoma